Clinical trial inclusion criterion:
ASA class 1 to 3 patients

Annotated entities:
- Measurement: "ASA class"
- Value: "1 to 3"